Clinical trial exclusion criterion:
6. Routine use (more than twice a week) of a chlorinated swimming pool.

Entity relations:
- Subsumes("Routine use", "more than twice a week")
- Has_multiplier("chlorinated swimming pool", "Routine use")